In an emergency setting, or hospitalized involuntarily

The above is a clinical trial exclusion criterion. Annotated with entity spans:
In an [Visit: emergency setting], or [Condition: hospitalized involuntarily]